Clinical trial exclusion criterion:
Has untreated active Hepatitis B

Entity relations:
- Has_qualifier("Hepatitis B", "active")
- Has_qualifier("Hepatitis B", "untreated")